Able to consent, fill out study documents, and complete all study procedures and follow-up visits

The above is a clinical trial inclusion criterion. Annotated with entity spans:
[Post-eligibility: Able to consent, fill out study documents, and complete all study procedures and follow-up visits]